下列有關單株抗體（monoclonal antibody）的敘述，何項最正確？
A. 都是 IgM
B. 可以辨認很多抗原決定位
C. 可以利用 staphylococcal Protein A 親和力管柱純化而得
D. 目前臨床上只能用於降低組織移植排斥的治療

正確答案：C. 可以利用 staphylococcal Protein A 親和力管柱純化而得